Clinical trial inclusion criteria:
Age : 18-65
Patients with major depressive disorder according to DSM-IV criteria that have lasted >8 weeks
MADRS total score of 18 or higher
Patients who responded inadequately (a score of >18 on the MADRS) to first-line antidepressant treatment of 4 week duration
Current use of standard antidepressant treatment in monotherapy or combination of 2 antidepressants : escitalopram (10 - 20mg/d), fluoxetine(20 - 40mg/d), paroxetine CR(25 - 50mg/d), sertraline(100 - 150mg/d), mirtazapine (15 - 45mg/d), duloxetine (30 - 60mg/d) or venlafaxine ER(150-225mg/d)

Annotated entities:
- Person: "Age"
- Value: "18-65"
- Condition: "major depressive disorder"
- Measurement: "DSM-IV criteria"
- Temporal: "lasted >8 weeks"
- Measurement: "MADRS"
- Value: "score of 18 or higher"
- Measurement: "MADRS"
- Value: "score of >18"
- Qualifier: "first-line"
- Drug: "antidepressant"
- Temporal: "of 4 week"
- Observation: "responded inadequately"
- Qualifier: "standard"
- Drug: "antidepressant"
- Qualifier: "monotherapy"
- Multiplier: "2"
- Drug: "antidepressants"
- Drug: "escitalopram"
- Drug: "fluoxetine"
- Drug: "paroxetine CR"
- Drug: "sertraline"
- Drug: "mirtazapine"
- Drug: "duloxetine"
- Multiplier: "10 - 20mg/d"
- Multiplier: "20 - 40mg/d"
- Multiplier: "25 - 50mg/d"
- Multiplier: "100 - 150mg/d"
- Multiplier: "15 - 45mg/d"
- Multiplier: "30 - 60mg/d"
- Drug: "venlafaxine ER"
- Multiplier: "150-225mg/d"